Clinical trial inclusion criterion:
The patient or his/her representative must have given free and informed consent and signed the consent

Annotated entities:
- Informed_consent: "The patient or his/her representative must have given free and informed consent and signed the consent"